37 歲男性因 2 小時前突發性腹痛入急診。病人為長期酗酒者，這幾年已陸續發作過 5、6 次的 胰臟炎而住院。以這位病人而言，下列何項敘述最合理？
A. 血液 amylase 與 lipase 有可能為正常，但不代表無胰臟發炎
B. 在急性期時使用 Ranson criteria 能對預後有很精確的預測
C. 血液 lipase 上升速度快，半衰期約 2 小時，3 天內會回復正常
D. 血液 amylase 或 lipase 愈高，代表胰臟發炎愈嚴重

正確答案：A. 血液 amylase 與 lipase 有可能為正常，但不代表無胰臟發炎